Physician diagnosis of chronic heart failure, American Heart Association Stage C-D

The above is a clinical trial inclusion criterion. Annotated with entity spans:
Physician diagnosis of [Condition: chronic heart failure], [Measurement: American Heart Association Stage] [Value: C-D]